El análisis de componentes principales es una técnica utilizada en quimiometría para:
1. Calcular los coeficientes de regresión ajustados.
2. Estudiar la varianza del conjunto de datos.
3. Encontrar un diseño experimental óptimo.
4. Reducir el número de datos.

Respuesta correcta: 4. Reducir el número de datos.